Los errores determinados (o sistemáticos) que se pueden cometer en un método analítico:
1. Hacen que los datos se dispersen más o menos de forma simétrica con respecto a un valor medio.
2. Tienen un valor definido y una causa asignable, dando lugar a un sesgo en los resultados de una serie de medidas.
3. Vienen reflejados en la precisión de una medida.
4. Nunca son atribuibles a los dispositivos de medición instrumental.
5. Dan como resultado valores atípicos, que difieren mucho de los demás en un conjunto de datos de medidas duplicadas.

Respuesta correcta: 2. Tienen un valor definido y una causa asignable, dando lugar a un sesgo en los resultados de una serie de medidas.